38 歲男性，因駕轎車撞橋墩被送到急診室，到院後評估發現，血壓 100/70 mmHg，心跳 88/分，呼吸次數 20/分，頸靜脈無怒張，無 cyanosis，呼吸音正常，胸部 X 光顯示縱膈變寬，以下何者是最可能的診斷？
A. 心包填塞（cardiac tamponade）
B. 主動脈剝離（aortic dissection）
C. 主動脈瘤破裂（ruptured aortic aneurysm）
D. 心肌挫傷（myocardial contusion）

正確答案：B. 主動脈剝離（aortic dissection）